Which are the mutational hotspots of the human KRAS oncogene?

The mutational hotspots for the K-ras oncogene are codons 12 and 13